下列何者在甲狀腺全切除術後，不適合接受碘-131治療？
A. 甲狀腺乳突癌papillary carcinoma（T1N1aM0）
B. 甲狀腺濾泡癌follicular carcinoma（T1N1aM0）
C. 甲狀腺髓質癌medullary carcinoma（T1N1aM0）
D. 甲狀腺何氏細胞癌Hürthle cell carcinoma（T1N1aM0）

正確答案：C. 甲狀腺髓質癌medullary carcinoma（T1N1aM0）